30 歲年輕男性因為急性腹瀉數十次來急診就醫，糞便的檢查發現有白血球，請問那一種致病菌的可能性最低？
A. Salmonella species
B. Shigella species
C. Vibrio cholerae
D. Vibrio parahaemolyticus

正確答案：C. Vibrio cholerae